一位 26 歲女性，近半年來腦海裡反覆地出現一些重複的想法，擔心家中門把和瓦斯開關沒關好所以反覆檢查，擔心自己手髒所以反覆洗手，明明知道不需要但還是反覆這樣做，每次均耗掉她一個小 時，因而嚴重影響到她上班的時間和人際關係。該位女性最可能罹有下列何種精神科疾病？
A. 情緒低落症（dysthymic disorder）
B. 強迫症（obsessive compulsive disorder）
C. 雙極性疾患（bipolar disorder）
D. 創傷後壓力症候群（posttraumatic stress disorder）

正確答案：B. 強迫症（obsessive compulsive disorder）